Clinical trial exclusion criterion:
(i.e. history of a severe allergic reaction to skin tests,,

Annotated entities:
- Condition: "severe allergic reaction"
- Procedure: "skin tests"
- Temporal: "history"